Clinical trial exclusion criterion:
< 4 seizures/week on average in baseline period

Entity relations:
- Has_multiplier("seizures", "< 4 /week")